What family do mDia proteins belong in?

mDia proteins are members of the formin family.